Clinical trial exclusion criterion:
patients received doxorubicin therapy, total cumulative dose of adriamycin was more than 300 mg/m2, total cumulative dose of epirubicin was more than 450 mg/m2;

Entity relations:
- Has_qualifier("adriamycin", "total cumulative dose")
- Has_multiplier("adriamycin", "more than 300 mg/m2")
- Has_qualifier("epirubicin", "total cumulative dose")
- Has_multiplier("epirubicin", "more than 450 mg/m2")
- OR("doxorubicin", "adriamycin", "epirubicin")